劉先生，35 歲，診斷為 HBe 抗原陽性之慢性 B 型肝炎，目前接受干安能（Lamivudine）治療 6 個月。 下列敘述何者錯誤？
A. 接受干安能治療一年的 HBe 抗原消失率約 20%
B. 接受干安能治療一年的抗藥性（drug resistance）發生率約 20%
C. 發生干安能抗藥性時，可合併干適能（Adefovir）作長期治療
D. HBe 抗原消失時，即可停藥，但要作密切追蹤以偵測復發（relapse）

正確答案：D. HBe 抗原消失時，即可停藥，但要作密切追蹤以偵測復發（relapse）